Clinical trial exclusion criterion:
have a history of solid organ or bone marrow transplant

Annotated entities:
- Procedure: "bone marrow transplant"
- Procedure: "solid organ transplant"
- Qualifier: "history"